¿Cómo se denomina el trastorno psicomotor que puede aparecer en un individuo que ha consumido fenotiacinas durante un periodo prolongado de tiempo?
1. Discinesia aguda.
2. Hipermimia.
3. Hipomimia.
4. Manierismos.
5. Discinesia tardía.

Respuesta correcta: 5. Discinesia tardía.